一位 66 歲男性，教職退休一年後，覺得缺乏運動，於是買了腳踏車準備鍛鍊身體。但是第一次出遊就因閃避來車而撞上路邊綠籬，右手肘被樹枝穿刺約 2-3 cm 深之傷口，經送醫包紮後回家休養，傷口紅腫、潰瘍、痛楚並有似膿分泌物，再經醫生診治後給予 7 天口服 Tetracycline 但情況並無好轉，後換成口服 Cephalexin 也沒有改善。約 15 天後，右手肘及手臂出現直線排列多處之具滲出液潰瘍（Oozing ulcers）及節瘤（Nodules）。檢體經過 25℃培養長出絲狀真菌，菌絲有分隔（Septate hyphae），分生孢子（Conidia）聚生於分生孢子柄的頂端以玫瑰花飾（Rosette）形狀排列，置於 37℃之培養則長出酵母菌菌落。這位男士感染了那種菌？
A. Conidiobolus coronatus
B. Sporothrix schenckii
C. Mycobacterium marinum
D. Staphylococcus aureus

正確答案：B. Sporothrix schenckii